Cases (with a history of TBI):

The above is a clinical trial exclusion criterion. Annotated with entity spans:
[Parsing_Error: Cases (with a history of TBI):]